Renal insufficiency (eGFR < 60 mL/kg/min)

The above is a clinical trial exclusion criterion. Annotated with entity spans:
[Condition: Renal insufficiency] ([Measurement: eGFR] [Value: < 60 mL/kg/min])